下列何者是兒童惡性橫紋肌肉瘤（rhabdomyosarcoma）較不好發的部位？
A. 頭頸部
B. 四肢
C. 腸胃道
D. 泌尿道系統

正確答案：C. 腸胃道